Clinical trial exclusion criterion:
Active intake of toxic amounts of alcohol or recreational drugs.

Entity relations:
- Has_multiplier("alcohol", "toxic amounts")
- Has_temporal("alcohol", "Active intake")
- Has_temporal("recreational drugs", "Active intake")
- OR("alcohol", "recreational drugs")